Clinical trial inclusion criterion:
History of preterm labor and/or midtrimester miscarriage in a previous pregnancy.

Entity relations:
- Has_temporal("pregnancy", "previous")
- AND("preterm labor", "pregnancy")
- OR("preterm labor", "midtrimester miscarriage")